En eucariotas, la ARN polimerasa I transcribe:
1. ARNr pequeños.
2. Pre-ARNm.
3. ARNsno.
4. ARNt.
5. ARNr grandes.

Respuesta correcta: 5. ARNr grandes.